Death by excessive bleeding (e.g., abdominal main artery rupture);

The above is a clinical trial exclusion criterion. Annotated with entity spans:
[Condition: Death by excessive bleeding] (e.g., [Qualifier: abdominal] [Condition: main artery rupture]);